Clinical trial exclusion criterion:
History of allergy to any component of the IP

Entity relations:
- AND("allergy", "any component of the IP")